Clinical trial inclusion criterion:
37+0 - 42+0 weeks of gestation

Entity relations:
- Has_value("weeks of gestation", "37+0")
- OR("37+0", "42+0")